Clinical trial exclusion criterion:
Prior malignancy within the previous 5 years (except for cured skin basal cell carcinoma or cervical carcinoma in situ)

Annotated entities:
- Condition: "malignancy"
- Temporal: "Prior"
- Temporal: "within the previous 5 years"
- Condition: "cured skin basal cell carcinoma"
- Condition: "cervical carcinoma in situ"
- Negation: "except for"